Healthy

The above is a clinical trial inclusion criterion. Annotated with entity spans:
[Value: Healthy]